Earlier allergic reactions to glucocorticosteroid or local anesthetic.

The above is a clinical trial exclusion criterion. Annotated with entity spans:
[Temporal: Earlier] [Condition: allergic reactions] to [Drug: glucocorticosteroid] or [Drug: local anesthetic].